Breast-feeding.

The above is a clinical trial exclusion criterion. Annotated with entity spans:
[Observation: Breast-feeding].